Clinical trial inclusion criterion:
Greater than or equal to 3 months of pain after onset of symptoms that has failed conservative treatments

Entity relations:
- Has_temporal("pain", "Greater than or equal to 3 months")
- Has_index("after onset of symptoms", "onset of symptoms")
- Has_temporal("pain", "after onset of symptoms")
- Has_mood("conservative treatments", "failed")
- AND("pain", "conservative treatments")